Clinical trial exclusion criteria:
Any concomitant cardiovascular procedure to CABG (i.e. valve, aortic or carotid surgery)
Acute ST-segment-elevation myocardial infarction (STEMI)
NSTE-ACS with cardiogenic shock warranting emergent salvage surgery within 12 hrs from hospital admission
History of atrial fibrillation or muscle disease (myopathy)
Current renal (creatinine>2x upper limit of normal (ULN), dialysis, kidney transplant) or hepatic dysfunction (AST/ALT>2x ULN, liver transplant or neoplasm)
Inability of oral drug intake

Annotated entities:
- Procedure: "cardiovascular procedure"
- Procedure: "CABG"
- Temporal: "concomitant"
- Procedure: "carotid surgery"
- Procedure: "aortic surgery"
- Procedure: "valve surgery"
- Condition: "Acute ST-segment-elevation myocardial infarction"
- Condition: "STEMI"
- Condition: "NSTE-ACS"
- Condition: "cardiogenic shock"
- Procedure: "salvage surgery"
- Mood: "warranting"
- Temporal: "within 12 hrs from hospital admission"
- Reference_point: "hospital admission"
- Condition: "atrial fibrillation"
- Condition: "muscle disease"
- Condition: "myopathy"
- Measurement: "creatinine"
- Value: ">2x upper limit of normal (ULN)"
- Procedure: "dialysis"
- Procedure: "kidney transplant"
- Condition: "renal dysfunction"
- Condition: "hepatic dysfunction"
- Measurement: "AST"
- Measurement: "ALT"
- Value: ">2x ULN"
- Procedure: "liver transplant"
- Condition: "neoplasm"
- Mood: "Inability of"
- Drug: "oral drug"
- Observation: "oral drug intake"
- Negation: "Inability"